Clinical trial exclusion criterion:
Evidence of type 1 diabetes and diabetics requiring insulin therapy.

Annotated entities:
- Condition: "type 1 diabetes"
- Condition: "diabetics"
- Qualifier: "requiring insulin therapy"
- Procedure: "insulin therapy"
- Drug: "insulin"